Prior invasive malignancy during the past 3 years other than non-melanomatous skin cancer. Note: Patients with prior surgically-cured malignancies [eg, stage I breast cancer or prostate cancer, in-situ carcinoma of the cervix, etc] are not excluded; however, sponsor approval must be obtained before patient is randomized.

The above is a clinical trial exclusion criterion. Annotated with entity spans:
[Temporal: Prior] [Qualifier: invasive] [Condition: malignancy] [Temporal: during the past 3 years] [Negation: other than] [Condition: non-melanomatous skin cancer]. Note: Patients with prior [Condition: surgically-cured malignancies] [eg, stage I breast cancer or prostate cancer, in-situ carcinoma of the cervix, etc] [Negation: are not] excluded; however, [Non-query-able: sponsor approval must be obtained before patient is randomized].